下列腫瘤何者較不會合併紅血球增生症？
A. 腎細胞癌（Renal cell carcinoma）
B. 淋巴瘤（Lymphoma）
C. 肝癌（Hepatocellular carcinoma）
D. 小腦血管母細胞瘤（Cerebellar hemangioblastoma）

正確答案：B. 淋巴瘤（Lymphoma）